Los carcinógenos epigenéticos:
1. Suelen ser sustancias químicas que no reaccionan directamente con el DNA para producir respuesta.
2. Actúan directamente con el DNA para causar neoplasias.
3. Engloban a los carcinógenos y activadores genotóxicos.
4. Requieren la bioactivación hasta carcinógeno final.

Respuesta correcta: 1. Suelen ser sustancias químicas que no reaccionan directamente con el DNA para producir respuesta.